Clinical trial exclusion criterion:
Lifetime personal history of diagnosis of major depressive disorder according to the DSM-V (American Psychiatric Association, 2013) using the Structured Clinical Interview for DSM-V Axis I Disorders, Research Version, Non-patient Edition (SCID-5-RV for DSM-V; First et al., 2015)

Entity relations:
- Has_qualifier("major depressive disorder", "DSM-V")
- AND("major depressive disorder", "Structured Clinical Interview for DSM-V Axis I Disorders, Research Version, Non-patient Edition")